Clinical trial exclusion criterion:
Positive serology for HIV, HCV, HBV.

Entity relations:
- Has_value("serology for HIV", "Positive")
- OR("serology for HIV", "serology for HBV", "serology for HCV")